Which are the main G1/S transcription factors in yeast?

MBF/SBF is the major transcriptional repressor of G1/S genes in Saccharomyces cerevisiae.